Clinical trial exclusion criterion:
Congenital adrenal hyperplasia (17-OH-progesterone> 2.5 ng / mL)

Entity relations:
- Has_value("17-OH-progesterone", "> 2.5 ng / mL")
- Subsumes("Congenital adrenal hyperplasia", "17-OH-progesterone")